History of malignancy including leukemia and lymphoma within recent 5 years except for localized basal cell carcinoma of the skin)

The above is a clinical trial exclusion criterion. Annotated with entity spans:
[Temporal: History of] [Condition: malignancy] including [Condition: leukemia] and [Condition: lymphoma] [Temporal: within recent 5 years] [Negation: except for] [Condition: localized basal cell carcinoma of the skin])